What is the number of protein coding genes in the human genome?

The number of protein coding genes in the human genome is currently estimated between 20,000 and 25,000